Clinical trial exclusion criterion:
Patient's pregnant or breast-feeding or child-bearing potential

Annotated entities:
- Condition: "pregnant"
- Condition: "breast-feeding"
- Condition: "child-bearing potential"